History of malignant tumor or life expectancy under 12 months.

The above is a clinical trial exclusion criterion. Annotated with entity spans:
History of [Condition: malignant tumor] or [Person: life expectancy] [Value: under 12 months].